Uncontrolled hypertension or metabolic disease

The above is a clinical trial exclusion criterion. Annotated with entity spans:
[Qualifier: Uncontrolled] [Condition: hypertension] or [Condition: metabolic disease]